What is the content of the METLIN database?

METLIN is a metabolite database containing tandem mass spectrometry data for each metabolite.